Clinical trial inclusion criterion:
Capable of giving informed consent.

Annotated entities:
- Observation: "informed consent"
- Mood: "Capable of giving"